Clinical trial exclusion criterion:
Genotype 2, 3, 5 or 6 infection.

Entity relations:
- Has_value("Genotype", "2, 3, 5 or 6")
- AND("infection", "Genotype")